History of penetrating keratoplasty.

The above is a clinical trial exclusion criterion. Annotated with entity spans:
[Temporal: History] of [Procedure: penetrating keratoplasty].